Clinical trial exclusion criterion:
If lab results are available in the last 6 months, then a serum creatinine =1.3 mg/dL on 2 occasions during screening and/or follow-up, indicating potential impairment of renal functioning;

Entity relations:
- Has_value("serum creatinine", "=1.3 mg/dL")
- Has_multiplier("serum creatinine", "2")